Clinical trial inclusion criterion:
Prostate cancer patients with a rise in PSA under hormone therapy.

Annotated entities:
- Condition: "Prostate cancer"
- Measurement: "PSA"
- Value: "rise"
- Procedure: "hormone therapy"